為何鼠疫桿菌（Yersinia pestis）被認為是較有潛能的生物戰劑？
A. 這細菌廣泛存在於歐亞大陸，易於分離
B. 現無有效的抗生素可以抑制它
C. 很容易經由蚊子叮咬，而傳播到許多人
D. 肺鼠疫易於傳染，且死亡率高

正確答案：D. 肺鼠疫易於傳染，且死亡率高